關於卵巢濾泡雙細胞雙性腺刺激素系統（two-cell，two-gonadotropin system）之敘述，下列何者錯誤？
A. 濾泡中顆粒細胞（granulosa cells）的細胞膜上有FSH受體（receptor）
B. 顆粒細胞中的芳香環轉化酶（aromatase）活性是受FSH的刺激才活化
C. 卵巢濾泡在排卵之後，黃體化的顆粒細胞之細胞膜上會同時出現FSH受體與LH受體
D. 卵巢濾泡周圍的卵囊膜細胞（theca cells）只有LH受體

正確答案：C. 卵巢濾泡在排卵之後，黃體化的顆粒細胞之細胞膜上會同時出現FSH受體與LH受體